Clinical trial inclusion criterion:
Left ventricular ejection fraction (LVEF) less than 40% by echocardiography during screening and randomization.

Annotated entities:
- Measurement: "Left ventricular ejection fraction (LVEF)"
- Value: "less than 40%"
- Procedure: "echocardiography"
- Temporal: "during screening and randomization"